Clinical trial exclusion criterion:
Patient unwilling to accept a pump

Annotated entities:
- Mood: "unwilling to accept"
- Negation: "unwilling"
- Device: "pump"